Clinical trial exclusion criterion:
Satisfies any contraindications or restrictions to Dapsone therapy as listed in the product labels.

Annotated entities:
- Condition: "contraindications"
- Drug: "Dapsone"